Clinical trial inclusion criteria:
1. Patient age ≥ 12 years
2. Presence of P. knowlesi malaria, confirmed by positive blood smear with asexual forms of P. knowlesi.
3. Temperature >38C on admission or fever during the preceding 48 hours
4. Enrolled within 18 hours of commencing antimalarial treatment
5. Written informed consent from patient or attending relative able to and willing to give informed consent. Consent form and information sheets will be translated into Malay and copies provided to the patient.

Annotated entities:
- Parsing_Error: "1."
- Person: "age"
- Value: "≥ 12 years"
- Parsing_Error: "2."
- Condition: "P. knowlesi malaria"
- Measurement: "blood smear"
- Value: "positive"
- Qualifier: "with asexual forms of P. knowlesi"
- Parsing_Error: "3."
- Measurement: "Temperature"
- Value: ">38C"
- Parsing_Error: "4."
- Temporal: "within 18 hours"
- Observation: "Enrolled"
- Reference_point: "commencing antimalarial treatment"
- Procedure: "antimalarial treatment"
- Parsing_Error: "5."
- Non-query-able: "Written informed consent from patient or attending relative able to and willing to give informed consent."
- Non-query-able: "Consent form and information sheets will be translated into Malay and copies provided to the patient"
- Not_a_criteria: "Consent form and information sheets will be translated into Malay and copies provided to the patient."
- Post-eligibility: "Written informed consent from patient or attending relative able to and willing to give informed consent."